Clinical trial exclusion criterion:
Current use of a third generation beta-blocker (nebivolol, carvedilol, or labetalol) or high dose of any beta-blockers (greater than 100 mg daily of metoprolol, or equivalent)

Entity relations:
- Subsumes("third generation beta-blocker", "nebivolol")
- Has_multiplier("metoprolol", "greater than 100 mg daily")
- Has_multiplier("any beta-blockers", "high dose")
- Subsumes("any beta-blockers", "metoprolol")
- OR("nebivolol", "carvedilol", "labetalol")
- OR("third generation beta-blocker", "any beta-blockers")